Clinical trial inclusion criterion:
Body mass index > 35

Entity relations:
- Has_value("Body mass index", "> 35")